Clinical trial exclusion criterion:
Patients with type I diabetes or poorly controlled type II diabetes (Hb1Ac>8.5).

Entity relations:
- Has_value("Hb1Ac", ">8.5")
- Has_qualifier("type II diabetes", "poorly controlled")
- AND("type II diabetes", "Hb1Ac")
- OR("type I diabetes", "type II diabetes")